Prominent personality disorder

The above is a clinical trial exclusion criterion. Annotated with entity spans:
[Condition: Prominent personality disorder]